Clinical trial exclusion criterion:
Unable to take oral medications

Annotated entities:
- Condition: "Unable to take"
- Drug: "oral medications"